Right handed

The above is a clinical trial inclusion criterion. Annotated with entity spans:
[Condition: Right handed]